Clinical trial exclusion criterion:
Coronary artery disease

Annotated entities:
- Condition: "Coronary artery disease"